一位年輕女性臉上有嚴重的痤瘡（青春痘，acne），若你將要處方維生素 A 酸（retinoic acid），下列相關敘述，何者正確？
A. 維生素 A 酸是維生素 K（vitamin K）之衍生物
B. 懷孕時服用有導致胎兒畸形之危險性
C. 只要停止服用維生素 A 酸一至兩星期後懷孕，便不會有胎兒畸形之危險性
D. 人類細胞核中並無維生素 A 之受體（receptor）

正確答案：B. 懷孕時服用有導致胎兒畸形之危險性